La expansión de repeticiones de tres nucleótidos es la causa de:
1. La anemia falciforme.
2. La enfermedad de Tay-Sachs.
3. La enfermedad de Huntington.
4. El escorbuto.

Respuesta correcta: 3. La enfermedad de Huntington.